Clinical trial exclusion criteria:
Patient refusal.
Emergency surgeries
Redo surgeries
Pregnancy
Vasculitis
Inflammation or infection at the study site
History of allergic reaction to study medications

Annotated entities:
- Post-eligibility: "Patient refusal"
- Procedure: "Emergency surgeries"
- Procedure: "Redo surgeries"
- Condition: "Pregnancy"
- Condition: "Vasculitis"
- Condition: "Inflammation"
- Condition: "infection"
- Qualifier: "study site"
- Condition: "allergic"
- Non-query-able: "History of allergic reaction to study medications"